Clinical trial inclusion criterion:
Has a HCC diagnosis confirmed by radiology, histology, or cytology (fibrolamellar, and mixed hepatocellular/cholangiocarcinoma subtypes are not eligible)

Entity relations:
- AND("HCC", "radiology")
- Has_negation("mixed hepatocellular/cholangiocarcinoma subtype", "not eligible")
- Has_negation("subtype fibrolamellar", "not eligible")
- AND("HCC", "subtype fibrolamellar")
- AND("HCC", "mixed hepatocellular/cholangiocarcinoma subtype")
- OR("radiology", "cytology", "histology")